¿Cuáles de estas vitaminas son compuestos isoprenoides?
1. Vitaminas A, B2, C y D.
2. Vitaminas A, B2 y Ácido fólico.
3. Vitaminas A, K y biotina.
4. Vitaminas D, E y C.
5. Vitaminas A, D, E y K.

Respuesta correcta: 5. Vitaminas A, D, E y K.